下列何種病人在接受牙科治療時，不需要給預防性抗生素以預防心內膜炎？
A. 有二尖瓣（mitral valve）脫垂但無二尖瓣逆流的病人
B. 有人工心臟瓣膜的病人
C. 有心內膜炎病史的病人
D. 心臟移植後有瓣膜病變的病人

正確答案：A. 有二尖瓣（mitral valve）脫垂但無二尖瓣逆流的病人